下列關於面部危險三角區域（danger triangle of the face）之面靜脈（facial vein）敘述何者錯誤？
A. 面靜脈與翼突靜脈叢（pterygoid venous plexus）可相交通
B. 面靜脈有良好的瓣膜系統可阻止血液回流
C. 面靜脈發炎可能引發海綿竇血栓靜脈炎（thrombophlebitis of cavernous sinus）
D. 危險三角區域的感染或發炎可沿著面靜脈蔓延到大腦靜脈系統

正確答案：B. 面靜脈有良好的瓣膜系統可阻止血液回流